Patients undergoing planned trans-femoral TAVI.

The above is a clinical trial inclusion criterion. Annotated with entity spans:
Patients [Temporal: undergoing] [Qualifier: planned] [Procedure: trans-femoral TAVI].